下列關於由 Epstein-Barr virus 所引起的傳染性單核球增多症（infectious mononucleosis）的臨床表現 ，何者錯誤？
A. 通常不會發燒
B. 大部分病人有頸部淋巴腺腫大的現象
C. 50%病人有脾臟腫大
D. 在病人的軟硬顎之間可看到 petechiae

正確答案：A. 通常不會發燒